Clinical trial exclusion criterion:
Active uncontrolled infection

Annotated entities:
- Condition: "infection"
- Qualifier: "uncontrolled"
- Temporal: "Active"